History of acute or chronic pancreatitis

The above is a clinical trial exclusion criterion. Annotated with entity spans:
History of [Condition: acute] or [Condition: chronic pancreatitis]